What is BORSA?

Borderline oxacillin-resistant Staphylococcus aureus (BORSA)